Mujer de 80 años que consulta por presentar, desde hace 1 mes, aumento progresivo del perímetro abdominal. Durante los 4-5 meses previos nota astenia, anorexia y adelgazamiento no precisado. En la exploración física se aprecia ascitis a tensión y edemas maleolares, sin otros signos relevantes. Una ecografía y TAC de abdomen demuestran la presencia de ascitis, de densidad homogénea, sin apreciarse implantes peritoneales ni masas abdominales o pélvicas. Hígado, páncreas, suprarrenales, bazo y riñones sin hallazgos significativos. Se realiza paracentesis a través de aguja gruesa, obteniéndose con dificultad un líquido algo amarillento, denso y gelatinoso. ¿Cuál es la etiología más probable?
1. Descompensación hidrópica secundaria a cirrosis hepática.
2. Ascitis quilosa por linfoma no Hodgkin.
3. Tuberculosis peritoneal.
4. Metástasis peritoneal de adenocarcinoma.
5. Ascitis secundaria a pericarditis constrictiva.

Respuesta correcta: 4. Metástasis peritoneal de adenocarcinoma.